下列何者為目前已知皮下真菌病（subcutaneous mycosis）中，具有兩型性（dimorphic）之病原菌？
A. 疣狀毛癬菌（Trichopyton verrucosum）
B. 申克孢子絲菌（Sporothrix schenckii）
C. 副冠耳黴（Conidiobolus coronatus）
D. 蛙糞黴（Basidiobolus ranarum）

正確答案：B. 申克孢子絲菌（Sporothrix schenckii）